Women be at least 18 years of age

The above is a clinical trial inclusion criterion. Annotated with entity spans:
[Person: Women] be [Value: at least 18 years] of [Person: age]